Clinical trial inclusion criterion:
endovascular mechanical thrombus fragmentation + thrombolytic therapy (using recombinant tissue activator of plasminogen), performed for treatment of the above-mentioned pulmonary embolism in less than 48 hours before randomization. The patient should be randomized no earlier than 24 hours after procedures endovascular mechanical thrombus fragmentation + thrombolytic therapy

Entity relations:
- AND("treatment", "pulmonary embolism")
- AND("thrombolytic therapy", "recombinant tissue activator of plasminogen")
- AND("endovascular mechanical thrombus fragmentation", "treatment")
- Has_temporal("treatment", "in less than 48 hours before randomization")
- AND("thrombolytic therapy", "treatment")